下列那一種免疫球蛋白受器常表現在肥大細胞（mast cell）表面上，並在結合 IgE 與過敏原後，可引發過敏反應？
A. FcαRI
B. FcεRI
C. FcγRI
D. FcγRIII

正確答案：B. FcεRI